Clinical trial exclusion criteria:
Cardiac morbidities
hypertensive disorders of pregnancy
peripartum bleeding
baseline systolic blood pressure (SBP) < 100 mmHg
body mass index > 35

Annotated entities:
- Condition: "Cardiac morbidities"
- Condition: "hypertensive disorders of pregnancy"
- Condition: "peripartum bleeding"
- Temporal: "baseline"
- Measurement: "systolic blood pressure"
- Measurement: "SBP"
- Value: "< 100 mmHg"
- Measurement: "body mass index"
- Value: "> 35"